History of three or more miscarriages

The above is a clinical trial exclusion criterion. Annotated with entity spans:
History of [Multiplier: three or more] [Condition: miscarriages]